Clinical trial inclusion criterion:
Time from onset to treatment =6 hours;

Entity relations:
- Has_value("Time from onset to treatment", "=6 hours")